Age between 31 and 60 years

The above is a clinical trial inclusion criterion. Annotated with entity spans:
[Person: Age] [Measurement: between 31 and 60 years]